Clinical trial inclusion criteria:
ST-segment elevation acute myocardial infarction patients during the first 12 hours of sympton onset;
Intention to perform primary percutaneous coronary intervention;
Signed informed consent;
Patient eligible for transradial and transfemoral primary percutaneous coronary intervention, being pre-requisites: (a) familiarity of the operator with the radial and femoral techniques using vascular closure devices, (b) agreement of the operator to use the access route determined by the randomization process.

Annotated entities:
- Qualifier: "ST-segment elevation"
- Condition: "acute myocardial infarction"
- Temporal: "during the first 12 hours of sympton onset"
- Condition: "percutaneous coronary intervention"
- Mood: "Intention to perform"
- Qualifier: "primary"
- Non-query-able: "Signed informed consent;"
- Qualifier: "transradial"
- Qualifier: "transfemoral"
- Qualifier: "primary"
- Procedure: "percutaneous coronary intervention"
- Mood: "eligible for"
- Non-representable: "being pre-requisites: (a) familiarity of the operator with the radial and femoral techniques using vascular closure devices, (b) agreement of the operator to use the access route determined by the randomization process."